Clinical trial exclusion criterion:
Concurrent prescription of medicines for ADHD or medicines that significantly could affect test performance.

Entity relations:
- AND("medicines", "ADHD")